Resting heart rate =80 bpm

The above is a clinical trial inclusion criterion. Annotated with entity spans:
[Measurement: Resting heart rate] [Value: =80 bpm]